no PROM

The above is a clinical trial inclusion criterion. Annotated with entity spans:
[Negation: no] [Condition: PROM]